Are at least 18 years of age

The above is a clinical trial inclusion criterion. Annotated with entity spans:
Are [Value: at least 18 years] of [Person: age]